一位 50 歲男性，被家人發現意識不清後送到急診（1 小時前還清醒），此時病患血壓 105/60 mmHg，心跳 70/min，呼吸 36/min，體溫 37.5℃，昏迷指數 GCS（Glasgow coma scale）= E1V2M4，兩眼瞳孔直徑 1 mm 等大，皆有光反應，淚水多，痰液分泌多。下列處置何者錯誤？
A. 可給予 100% 氧氣及插管
B. 可注射 atropine
C. 可注射 PAM（pralidoxime）
D. 注射 atropine 之最大劑量不可超過 3 mg

正確答案：D. 注射 atropine 之最大劑量不可超過 3 mg